Unstable patient

The above is a clinical trial exclusion criterion. Annotated with entity spans:
[Qualifier: Unstable] [Person: patient]